Clinical trial exclusion criterion:
Patients with a contraindication to VCE (small bowel strictures, oropharyngeal dysphagia, pregnancy, patients who are not surgical candidates)

Annotated entities:
- Condition: "contraindication"
- Procedure: "VCE"
- Condition: "small bowel strictures"
- Condition: "oropharyngeal dysphagia"
- Condition: "pregnancy"
- Negation: "not"
- Observation: "surgical candidates"